Clinical trial inclusion criterion:
A signed parental consent form.

Annotated entities:
- Informed_consent: "A signed parental consent form"